Clinical trial inclusion criteria:
DSM-5 diagnosis of insomnia

Annotated entities:
- Condition: "insomnia"
- Qualifier: "DSM-5"